Clinical trial exclusion criterion:
past esophageal, gastric or bariatric surgery

Annotated entities:
- Procedure: "bariatric surgery"
- Procedure: "gastric surgery"
- Procedure: "esophageal surgery"